De los siguientes pacientes ¿cuáles tienen que realizar un pago al adquirir medicamentos?:
1. Afectados del síndrome tóxico.
2. Pensionistas de Mutualidad General Judicial (MUGEJU).
3. Personas con tratamientos derivados de enfermedad laboral.
4. Parados que hayan perdido el derecho a percibir el subsidio de desempleo en tanto persista su situación.

Respuesta correcta: 2. Pensionistas de Mutualidad General Judicial (MUGEJU).